La labilidad afectiva se caracteriza porque:
1. Se producen cambios rápidos de la emoción y la persona tiene dificultades para controlar sus emociones.
2. Se produce una elevación del umbral afectivo atencional para estímulos negativos.
3. Hay un sentimiento general de encontrarse muy bien, muy alegre, aunque no existan causas que justifiquen ese estado de ánimo.
4. El estado de ánimo es predominante abatido, pesimista, triste.
5. Se produce un estrechamiento afectivo que restringe la vida emocional.

Respuesta correcta: 1. Se producen cambios rápidos de la emoción y la persona tiene dificultades para controlar sus emociones.